Presence of a significant medical or psychiatric condition (Examples include: Diagnosis and treatment of tuberculosis (TB) or HIV; renal insufficiency; hepatic disease; oral or parenteral medication known to affect the immune function, such as corticosteroids, other immunosuppressant drugs; or behavioural or memory issues)

The above is a clinical trial exclusion criterion. Annotated with entity spans:
Presence of a [Qualifier: significant] [Condition: medical] or [Condition: psychiatric condition] (Examples include: Diagnosis and [Procedure: treatment] of [Condition: tuberculosis (TB)] or [Condition: HIV]; [Condition: renal insufficiency]; [Condition: hepatic disease]; [Drug: oral] or [Drug: parenteral medication] [Qualifier: known to affect the immune function], such as [Drug: corticosteroids], [Qualifier: other] [Drug: immunosuppressant drugs]; or [Condition: behavioural] or [Condition: memory issues])